The participant has a Mini-Mental State Examinations (MMSE) score of <= 24. psychiatric disease.

The above is a clinical trial exclusion criterion. Annotated with entity spans:
[Parsing_Error: The participant has a Mini-Mental State Examinations (MMSE) score of <= 24. psychiatric disease.]